Clinical trial inclusion criterion:
In line with clinical stage I / II stage (T1-2 N0 M0; AJCC 2010) and receiving surgical resection

Entity relations:
- Has_value("T", "1-2")
- Has_value("N", "0")
- Has_value("M", "0")
- Subsumes("clinical stage I", "T")
- OR("clinical stage I", "clinical stage II")